Clinical trial inclusion criterion:
OR any FEV1 with chronic supplemental oxygen requirement at rest and/or with exertion

Entity relations:
- Has_qualifier("chronic supplemental oxygen requirement", "at rest")
- OR("at rest", "with exertion")